Clinical trial exclusion criterion:
patients included in another interventional clinical study involving infections or antibiotics and having the same primary parameter,

Annotated entities:
- Competing_trial: "patients included in another interventional clinical study involving infections or antibiotics and having the same primary parameter"